Clinical trial exclusion criteria:
signs of complicated UTI (e. g. temperature > 38°C, loin tenderness)
conditions that may lead to complicated infections (i.e. renal diseases, patients with urinary catheter)
pregnancy/ breastfeeding
current self-medication with UU preparations e.g. z.B. Cystinol®, Uvalysat®, Arctuvan®
antibiotic use in the last 7 days
previous UTI in the past 2 weeks
history of pyelonephritis
contraindications for trial drugs
serious diseases
inability to understand trial Information
current participation in another clinical trial or participation in another clinical trial within the last 4 weeks

Annotated entities:
- Condition: "complicated UTI"
- Condition: "loin tenderness"
- Measurement: "temperature"
- Value: "> 38°C"
- Condition: "conditions"
- Condition: "complicated infections"
- Condition: "renal diseases"
- Device: "urinary catheter"
- Person: "patients"
- Pregnancy_considerations: "pregnancy/ breastfeeding"
- Drug: "UU preparations"
- Drug: "z.B. Cystinol®"
- Drug: "Uvalysat®"
- Drug: "Arctuvan®"
- Qualifier: "self-medication"
- Drug: "antibiotic"
- Temporal: "last 7 days"
- Condition: "UTI"
- Temporal: "past 2 weeks"
- Condition: "pyelonephritis"
- Mood: "contraindications for"
- Drug: "drugs"
- Qualifier: "trial"
- Condition: "diseases"
- Qualifier: "serious"
- Post-eligibility: "inability to understand trial Information"
- Non-query-able: "current participation in another clinical trial or participation in another clinical trial within the last 4 weeks"